下列關於 organic nitrates 之敘述，何者正確？
A. nitroglycerin 口服後之生體可用率（oral bioavailability）高達 70%
B. nitroglycerin 舌下含服的藥效可長達三小時
C. nitroglycerin 由靜脈注射給予持續數小時可能產生耐藥性（tolerance）
D. amyl nitrite 吸入方式給藥後之首度效應（hepatic first-pass effect）高

正確答案：C. nitroglycerin 由靜脈注射給予持續數小時可能產生耐藥性（tolerance）